Clinical trial exclusion criterion:
F4 or decompensated cirrhotic patients

Annotated entities:
- Condition: "decompensated cirrhotic"
- Observation: "F4"